Must agree not to donate blood or other bodily fluid while taking the study drug and for 28 days thereafter

The above is a clinical trial inclusion criterion. Annotated with entity spans:
[Mood: Must agree] [Negation: not] to [Procedure: donate blood] or other bodily fluid [Temporal: while taking the study drug] and [Temporal: for 28 days thereafter]